Clinical trial inclusion criterion:
Admissible medical/surgical history

Entity relations:
- Has_qualifier("medical history", "Admissible")
- Has_qualifier("surgical history", "Admissible")